evidence of severe cardiac disease.

The above is a clinical trial exclusion criterion. Annotated with entity spans:
[Mood: evidence of] [Qualifier: severe] [Condition: cardiac disease].